巴比妥類藥物，如thiopental，其主要作用機轉為何，使其可產生良好的鎮靜作用？
A. 阻斷鈉離子通道（sodium channel blocker）
B. 加強γ-aminobutyric acid receptor作用
C. 抑制N-methyl-D-aspartate receptor作用
D. 加強α2 adrenergic receptor作用

正確答案：B. 加強γ-aminobutyric acid receptor作用